need for therapies that may obscure the results of treatment and/or of the study

The above is a clinical trial exclusion criterion. Annotated with entity spans:
[Non-query-able: need for therapies that may obscure the results of treatment and/or of the study]